De acuerdo con la estrategia para el abordaje de la Cronicidad en el Sistema Nacional de Salud por el Ministerio de Sanidad, Servicios Sociales e Igualdad en 2012, se consideran todas las condiciones de salud y limitaciones en la actividad de carácter crónico como:
1. Enfermedades respiratorias crónicas, cáncer, diabetes y enfermedades cardiovasculares.
2. Enfermedades cardiovasculares, enfermedades respiratorias crónicas, cáncer, diabetes y problemas de salud mental.
3. Problemas de salud mental con minusvalía, enfermedades respiratorias crónicas, diabetes, enfermedades cardiovasculares y cáncer.
4. Enfermedades cardiovasculares, enfermedad mental, enfermedades respiratorias crónicas, cáncer y diabetes.

Respuesta correcta: 2. Enfermedades cardiovasculares, enfermedades respiratorias crónicas, cáncer, diabetes y problemas de salud mental.